有一個研究探討某一藥物對於尿液鈣離子的排泄效應，有 9 位受試者被隨機選出，口服 0.5 毫克的藥物，在服用藥物 6 個小時後收集這些人的尿液。另隨機抽取 16 位受試者，這些人不服用藥物，同樣在被隨機選出後 6 個小時收集這些人的尿液。研究者的問題是「這兩群人排泄的尿液鈣離子濃度是否顯著不同？」你將採用何種統計方法檢定上述資料？
A. 兩個樣本 t 檢定
B. 卡方檢定
C. 配對 t 檢定
D. 麥內瑪檢定（McNemar's Test）

正確答案：A. 兩個樣本 t 檢定